Congestive heart failure or coronary artery disease

The above is a clinical trial exclusion criterion. Annotated with entity spans:
[Condition: Congestive heart failure] or [Condition: coronary artery disease]